Clinical trial exclusion criterion:
Persons referred to in Articles L1121-5 to L1121-8 of the French Public health Code: pregnant woman, parturient, nursing mother, person deprived of liberty by judicial or administrative decision, person subject to a legal protection measure, can not Be included in clinical trials.

Entity relations:
- AND("woman", "pregnant")
- Subsumes("Persons referred to in Articles L1121-5 to L1121-8 of the French Public health Code", "woman")
- OR("woman", "parturient", "deprived of liberty", "subject to a legal protection", "nursing")